下列何者不是由內細胞團（inner cell mass）衍生而成？
A. 滋養層（trophoblast）
B. 卵黃囊（yolk sac）
C. 接合莖（connecting stalk）
D. 羊膜（amnion）

正確答案：A. 滋養層（trophoblast）